have no prior CAD associated event (no prior myocardial infarction, acute coronary syndrome, coronary angiogram, or PCI),

The above is a clinical trial inclusion criterion. Annotated with entity spans:
have [Negation: no] prior [Condition: CAD] associated event (no prior [Condition: myocardial infarction], [Condition: acute coronary syndrome], [Procedure: coronary angiogram], or [Procedure: PCI]),